What is the target of tanezumab?

Tanezumab is a humanized monoclonal antibody against nerve growth factor.